Clinical trial inclusion criterion:
Adequate bone marrow function(absolute neutrophil count [ANC] ≥1,500/µL, hemoglobin ≥9.0 g/dL,and platelets ≥100,000/µL)

Annotated entities:
- Measurement: "bone marrow function"
- Value: "Adequate"
- Measurement: "absolute neutrophil count [ANC]"
- Value: "≥1,500/µL"
- Measurement: "hemoglobin"
- Value: "≥9.0 g/dL"
- Measurement: "platelets"
- Value: "≥100,000/µL"